Clinical trial inclusion criterion:
18-year or older patients

Annotated entities:
- Value: "18-year or older"
- Person: "old"